李先生 30 年前因為胃潰瘍接受過部分胃切除手術，最近一個月以來，開始出現餐前上腹部悶痛，食量減少與飯後嗝氣等現象，同時體重也從六十公斤降至五十二公斤。李先生最可能的診斷為何？
A. 復發性胃潰瘍
B. 十二指腸潰瘍併胃出口狹窄
C. 胃癌
D. 胃功能性障礙

正確答案：C. 胃癌